Be on a stable regimen of antiparkinson's medications at least 30 days prior to screening, and be expected to remain on a stable dose for the duration of the study.

The above is a clinical trial inclusion criterion. Annotated with entity spans:
Be on a stable regimen of [Drug: antiparkinson's medications] [Temporal: at least 30 days prior to screening], and be expected to remain on a stable dose for the duration of the study.